糖尿病病人所表現出的黎明現象（dawn phenomenon），可能和下列何種荷爾蒙的分泌有關？
A. 升糖素（glucagon）
B. 胰島素（insulin）
C. 促腎上腺素（ACTH）
D. 生長激素（GH）

正確答案：D. 生長激素（GH）